一位 4 個月大，體重 4 公斤的男嬰，因為反覆抽搐（seizure）及低血鈣症，住進醫院的加護病房。自從出生後，他就常拉肚子，並有反覆且難以治癒的念珠菌（Candida）感染。身體診察發現左胸骨下緣有第三度心雜音，您認為最可能的診斷為何？
A. DiGeorge syndrome
B. Wiskott-Aldrich syndrome
C. X-linked agammaglobulinemia
D. common variable immunodeficiency

正確答案：A. DiGeorge syndrome